Clinical trial exclusion criterion:
Non papillary gross features of the tumor

Entity relations:
- AND("tumor", "Non papillary gross features")